Patient refusal

The above is a clinical trial exclusion criterion. Annotated with entity spans:
[Informed_consent: Patient refusal]